Clinical trial inclusion criterion:
Never receiving adequate treatment or stop receiving treatment for at least 8 weeks

Entity relations:
- Has_negation("treatment", "Never")
- Has_qualifier("treatment", "adequate")
- Has_negation("treatment", "stop")
- Has_temporal("treatment", "for at least 8 weeks")
- OR("treatment", "treatment")